一個孩子會跑、會正確的指認身體每個部位，依照正常的發展里程，此兒童最接近的年齡為何？
A. 2歲
B. 1歲
C. 1歲6個月
D. 9個月

正確答案：A. 2歲